Clinical trial exclusion criterion:
Patients with severe cardiac conditions: heart failure (NYHA Class 3 or 4), history of ischemic cardiac disease (unstable angina, myocardial infarction), peripheral vascular diseases, percutaneous transluminal angioplasty or coronary artery bypass graft within recent 6 months.

Annotated entities:
- Qualifier: "severe"
- Condition: "cardiac conditions"
- Condition: "heart failure"
- Measurement: "NYHA"
- Value: "Class 3 or 4"
- Temporal: "history"
- Condition: "ischemic cardiac disease"
- Condition: "unstable angina"
- Condition: "myocardial infarction"
- Condition: "peripheral vascular diseases"
- Procedure: "percutaneous transluminal angioplasty"
- Procedure: "coronary artery bypass graft"
- Temporal: "within recent 6 months"